Clinical trial exclusion criterion:
Inability or unwillingness to provide informed consent or abide by the requirements of the study.

Annotated entities:
- Post-eligibility: "Inability or unwillingness to provide informed consent or abide by the requirements of the study."